Clinical trial exclusion criterion:
Contraindications to exposure to a magnetic field

Annotated entities:
- Condition: "Contraindications"
- Device: "magnetic field"